Clinical trial inclusion criterion:
BUN = 50mg/dl

Annotated entities:
- Measurement: "BUN"
- Value: "= 50mg/dl"